Clinical trial inclusion criterion:
confirmed diagnosis of H. pylori infection by at least one of the following methods: 13C-urea breath test, histology, rapid urease test or bacterial culture

Annotated entities:
- Condition: "H. pylori infection"
- Measurement: "13C-urea breath test"
- Measurement: "histology"
- Measurement: "rapid urease test"
- Measurement: "bacterial culture"